History of "Major Bleeding" at any point (defined as overt bleeding at a critical site including intracranial, intraspinal, intraocular, pericardial, or retroperitoneal; or bleed requiring hospitalization).

The above is a clinical trial exclusion criterion. Annotated with entity spans:
[Temporal: History] of "[Condition: Major Bleeding]" [Temporal: at any point] (defined as [Condition: overt bleeding] at a [Qualifier: critical site] including [Qualifier: intracranial], [Qualifier: intraspinal], [Qualifier: intraocular], [Qualifier: pericardial], or [Qualifier: retroperitoneal]; or [Condition: bleed] requiring [Procedure: hospitalization]).